Aged 18 years or older

The above is a clinical trial inclusion criterion. Annotated with entity spans:
[Person: Aged] [Value: 18 years or older]